Without phone

The above is a clinical trial exclusion criterion. Annotated with entity spans:
[Negation: Without] [Observation: phone]